Evidence or suspect of Progressive Multifocal Leukoencephalopathy (PML) in Magnetic Resonance Imaging (MRI).

The above is a clinical trial exclusion criterion. Annotated with entity spans:
[Mood: Evidence] or [Mood: suspect] of [Condition: Progressive Multifocal Leukoencephalopathy (PML)] in [Procedure: Magnetic Resonance Imaging (MRI)].